age <18 years

The above is a clinical trial exclusion criterion. Annotated with entity spans:
[Person: age] [Value: <18 years]